ASA 1

The above is a clinical trial inclusion criterion. Annotated with entity spans:
[Condition: ASA 1]